Clinical trial exclusion criterion:
1. Does not have a documented history of generalized seizures.

Entity relations:
- Has_negation("generalized seizures", "not")
- Has_temporal("generalized seizures", "history")